Clinical trial inclusion criterion:
1 to 17 years of age (before 18th birthday)

Annotated entities:
- Value: "1 to 17 years"
- Person: "age"